Clinical trial inclusion criterion:
A concentration of LDL-cholesterol above 100 mg / dl, in the month prior to inclusion.

Entity relations:
- Has_value("LDL-cholesterol", "above 100 mg / dl")
- Has_index("in the month prior to inclusion", "inclusion")
- Has_temporal("LDL-cholesterol", "in the month prior to inclusion")